Clinical trial inclusion criteria:
Written consent for participation in the clinical trial
Age 18 to 45 years Irregular menstruation (> 35 days) or secondary amenorrhea> 3 months

Annotated entities:
- Informed_consent: "Written consent for participation in the clinical trial"
- Person: "Age"
- Value: "18 to 45 years"
- Condition: "Irregular menstruation"
- Line: "Age 18 to 45 years"
- Line: "Irregular menstruation (> 35 days) or secondary amenorrhea> 3 months"
- Value: "> 35 days"
- Condition: "secondary amenorrhea"
- Temporal: "> 3 months"